Clinical trial inclusion criterion:
Refractory to conservative treatment

Entity relations:
- Has_qualifier("conservative treatment", "Refractory")